Clinical trial inclusion criterion:
Female with a persisting pregnancy of unknown location:

Entity relations:
- Has_qualifier("pregnancy", "unknown location")